下列那一種情況會減少茶鹼（theophylline）之清除率（clearance），造成血液中茶鹼藥物濃度升高？
A. 心臟衰竭
B. 抽菸
C. 使用 rifampicin
D. 使用 phenobarbital

正確答案：A. 心臟衰竭